Clinical trial inclusion criteria:
=32 weeks gestational age at birth
=6 weeks postnatal age at randomization
Remains hospitalized after birth (has never been discharged home)
Treating clinician deems infant eligible to receive 2-month vaccines
English- or Spanish-speaking parent(s)/legally authorized representative(s) (LAR(s))
Not planned for discharge within 60 hours of study entry
The parent/guardian must be willing and capable of providing permission for their child to participate through the written informed consent process

Annotated entities:
- Measurement: "gestational age at birth"
- Value: "=32 weeks"
- Measurement: "postnatal age"
- Temporal: "at randomization"
- Value: "=6 weeks"
- Observation: "hospitalized"
- Temporal: "after birth"
- Reference_point: "birth"
- Mood: "eligible"
- Drug: "2-month vaccines"
- Non-query-able: "English- or Spanish-speaking parent(s)/legally authorized representative(s) (LAR(s))"
- Mood: "planned"
- Procedure: "discharge"
- Temporal: "within 60 hours of study entry"
- Reference_point: "study entry"
- Measurement: "Not"
- Informed_consent: "The parent/guardian must be willing and capable of providing permission for their child to participate through the written informed consent process"